Varón homosexual de 30 años de edad VIH (+) que participa como voluntario en un centro de ayuda a pacientes con SIDA. Según su historia clínica recibió toxoide diftérico (Td) hace 6 años, la vacuna triple vírica en la infancia y en la adolescencia, y la hepatitis B hace 3 años. Actualmente se encuentra asintomático con un recuento de CD4 superior a 200 cls/µl. ¿Qué vacunas deberíamos recomendarle?
1. Gripe estacional, neumocócica, meningitis tetravalente y hepatitis A.
2. Gripe estacional, Td, neumocócica y meningitis tetravalente.
3. Meningitis tetravalente, neumocócica y gripe estacional.
4. Td, meningitis tetravalente, neumocócica.
5. Triple vírica, gripe estacional, neumocócica.

Respuesta correcta: 1. Gripe estacional, neumocócica, meningitis tetravalente y hepatitis A.